Clinical trial inclusion criterion:
For women of childbearing age is a negative result of a pregnancy test before vaccination.

Annotated entities:
- Pregnancy_considerations: "For women of childbearing age is a negative result of a pregnancy test before vaccination."